Clinical trial exclusion criteria:
1. Does not have a documented history of generalized seizures.
2. Has not had a GTC seizure within the last year AND is not expected to have a reduction of anti-epileptic drugs during their hospital admission.
3. Intracranial EEG electrodes are being used
4. The subject's upper arm circumference not adequate for proper fit of the EMG monitor (less than 14cm).
5. Pregnant female.
6. Subject/Caregiver is unable to provide consent.

Annotated entities:
- Parsing_Error: "1."
- Condition: "generalized seizures"
- Temporal: "history"
- Negation: "not"
- Parsing_Error: "2."
- Condition: "GTC seizure"
- Negation: "not"
- Temporal: "within the last year"
- Drug: "anti-epileptic drugs"
- Procedure: "reduction of anti-epileptic drugs"
- Temporal: "during their hospital admission"
- Reference_point: "hospital admission"
- Negation: "not"
- Parsing_Error: "3."
- Device: "Intracranial EEG electrodes"
- Parsing_Error: "4."
- Measurement: "upper arm circumference"
- Qualifier: "adequate for proper fit of the EMG monitor"
- Negation: "not"
- Non-query-able: "adequate for proper fit of the EMG monitor"
- Value: "less than 14cm"
- Parsing_Error: "5."
- Person: "female"
- Condition: "Pregnant"
- Parsing_Error: "6."
- Non-query-able: "Subject/Caregiver is unable to provide consent."
- Post-eligibility: "Subject/Caregiver is unable to provide consent."